Clinical trial exclusion criterion:
Already on medications that may affect thyroid function (L-T4, carbimazole, propylthiouracil, amiodarone, lithium).

Entity relations:
- Has_value("thyroid function", "affect")
- Subsumes("medications", "L-T4")
- AND("medications", "thyroid function")
- OR("L-T4", "amiodarone", "propylthiouracil", "carbimazole", "lithium")